Under the age of 15

The above is a clinical trial exclusion criterion. Annotated with entity spans:
[Value: Under] the [Person: age] of 15